Clinical trial inclusion criterion:
Postmenopausal women with postmenopausal defined as permanent cessation >1 year of previously occurring menses.

Annotated entities:
- Pregnancy_considerations: "Postmenopausal women with postmenopausal defined as permanent cessation >1 year of previously occurring menses."